縱膈手術後，聲音沙啞且聲帶不動，下列何者的分支最可能損傷？
A. 膈神經
B. 副神經
C. 迷走神經
D. 交感神經叢

正確答案：C. 迷走神經